Dilantin and oral contraceptive usage due to potential drug interaction with glitazones

The above is a clinical trial exclusion criterion. Annotated with entity spans:
[Drug: Dilantin] and [Drug: oral contraceptive] usage due to [Mood: potential] [Condition: drug interaction] with [Drug: glitazones]